Women of Childbearing potential without proper contraceptive measures, pregnancy or breast feeding

The above is a clinical trial exclusion criterion. Annotated with entity spans:
[Person: Women] of [Condition: Childbearing potential] [Negation: without] proper [Procedure: contraceptive measures], [Condition: pregnancy] or [Observation: breast feeding]